一位 45 歲女性因嚴重慢性胰臟炎入院，腹部超音波顯示並無偽性囊腫（pseudocyst）或膽石症（cholelithiasis），內視鏡逆行性膽道胰管攝影（ERCP）發現胰管擴張並且有多處狹窄，則下列何種術式最適當？
A. cholecystectomy
B. splenectomy
C. distal pancreatectomy
D. pancreaticojejunostomy（Puestow）

正確答案：D. pancreaticojejunostomy（Puestow）